Clinical trial inclusion criterion:
Children with clinical diagnosis of PWS;

Annotated entities:
- Person: "Children"
- Qualifier: "clinical diagnosis"
- Condition: "PWS"